Clinical trial inclusion criterion:
Patients deemed as resectable by pancreatic protocol CT or MRI

Annotated entities:
- Condition: "deemed as resectable"
- Procedure: "pancreatic protocol CT"
- Procedure: "pancreatic protocol MRI"